Clinical trial exclusion criterion:
1. Justification: Subjects should be able to perform cognitive tasks to a high degree of accuracy, both in the MRI scanner and outside the scanner. Subjects with ADHD/LD may engage different neural circuitry even if they can perform the tasks.

Annotated entities:
- Parsing_Error: "1."
- Not_a_criteria: "Justification: Subjects should be able to perform cognitive tasks to a high degree of accuracy, both in the MRI scanner and outside the scanner."
- Condition: "ADHD"
- Condition: "LD"
- Parsing_Error: "Subjects with ADHD/LD may engage different neural circuitry even if they can perform the tasks."
- Not_a_criteria: "Subjects with ADHD/LD may engage different neural circuitry even if they can perform the tasks."
- Parsing_Error: "Justification: Subjects should be able to perform cognitive tasks to a high degree of accuracy, both in the MRI scanner and outside the scanner."